Clinical trial exclusion criterion:
Patient treated with immunosuppressive within 1 month before study inclusion.

Annotated entities:
- Drug: "immunosuppressive"
- Temporal: "within 1 month before study inclusion"
- Reference_point: "study inclusion"